Clinical trial exclusion criterion:
7. Other serious medical illness likely to interfere with study participation or with the ability to complete the trial by the judgment of the investigator (e.g. unstable psychiatric condition).

Entity relations:
- Has_qualifier("psychiatric condition", "unstable")
- Subsumes("Other medical illness", "psychiatric condition")
- Subsumes("serious", "psychiatric condition")